Clinical trial exclusion criterion:
Receipt of blood or blood products 8 weeks prior to vaccination or planned administration during the three week study period following vaccination

Entity relations:
- Has_index("8 weeks prior to vaccination", "vaccination")
- Has_index("during the three week study period following vaccination", "three week study period following vaccination")
- Has_temporal("planned administration", "during the three week study period following vaccination")
- Has_temporal("Receipt of blood", "8 weeks prior to vaccination")
- OR("Receipt of blood", "Receipt of blood products")
- OR("8 weeks prior to vaccination", "planned administration")